Clinical trial inclusion criterion:
elective procedure

Annotated entities:
- Procedure: "elective procedure"